Patients who are concurrently enrolled in another active interventional clinical trial testing a drug or intervention known or believed to interact with aspirin, warfarin, or rivaroxaban;

The above is a clinical trial exclusion criterion. Annotated with entity spans:
[Competing_trial: Patients who are concurrently enrolled in another active interventional clinical trial testing a drug or intervention known or believed to interact with aspirin, warfarin, or rivaroxaban];